Clinical trial exclusion criteria:
Autoimmune hepatitis
Primary sclerosing cholangitis

Annotated entities:
- Condition: "Autoimmune hepatitis"
- Condition: "Primary sclerosing cholangitis"